Clinical trial exclusion criterion:
Existence of any surgical, medical or mental conditions, other than the current transplantation, which, in the opinion of the investigator, might interfere with the objectives of the study.

Annotated entities:
- Condition: "surgical conditions"
- Condition: "medical conditions"
- Condition: "mental conditions"
- Negation: "other than"
- Temporal: "current"
- Procedure: "transplantation"
- Qualifier: "might interfere with the objectives of the study"